下列何者不屬於 adrenergic neuron 阻斷劑？
A. guanethidine
B. trimethaphan
C. debrisoquin
D. reserpine

正確答案：B. trimethaphan